¿Qué estudios se deben realizar en un adenocarcinoma con diferenciación mucinosa prominente de colon ascendente diagnosticado en un hombre de 32 años?
1. Reordenamiento del gen MYC.
2. Análisis de inestabilidad de microsatélites.
3. Estudio de mutaciones del gen RET.
4. Estudio de mutaciones de BRCA1-2.
5. Estudios de mutaciones de TP53.

Respuesta correcta: 2. Análisis de inestabilidad de microsatélites.